Clinical trial exclusion criterion:
serious mental disorder

Annotated entities:
- Condition: "serious mental disorder"